drug or alcohol abuse

The above is a clinical trial exclusion criterion. Annotated with entity spans:
[Drug: drug] or [Drug: alcohol abuse]